Clinical trial exclusion criterion:
Subject is a breastfeeding woman.

Annotated entities:
- Pregnancy_considerations: "Subject is a breastfeeding woman"